Clinical trial inclusion criterion:
Adequate hepatic function:

Annotated entities:
- Parsing_Error: "Adequate hepatic function:"